Clinical trial exclusion criterion:
Calculated creatinine clearance < 30 mL/min by Cockcroft-Gault formula

Annotated entities:
- Measurement: "Calculated creatinine clearance"
- Value: "< 30 mL/min"
- Measurement: "Cockcroft-Gault formula"